Clinical trial exclusion criterion:
Kidney, parathyroid, congenital bone metabolic disease

Annotated entities:
- Qualifier: "Kidney"
- Qualifier: "parathyroid"
- Qualifier: "congenital"
- Qualifier: "bone"
- Qualifier: "metabolic"
- Condition: "disease"